Clinical trial exclusion criterion:
Elevated liver enzyme (aspartate transaminase (AST)/ alanine transaminase(ALT) level are more than twice normal range) , history of liver cirrhosis, impaired liver function(elevated total bilirubin level) and coagulopathy (including long-term use anticoagulant)

Annotated entities:
- Measurement: "liver enzyme"
- Value: "Elevated"
- Measurement: "aspartate transaminase (AST)/ alanine transaminase(ALT) level"
- Value: "more than twice normal range"
- Temporal: "history"
- Condition: "liver cirrhosis"
- Condition: "impaired liver function"
- Value: "elevated"
- Measurement: "total bilirubin level"
- Condition: "coagulopathy"
- Multiplier: "long-term use"
- Drug: "anticoagulant"